¿De qué modelo de la Evaluación psicológica son propias la Técnica de Rejilla y otras apropiadas para evaluar los significados del sujeto?
1. Modelo Constructivista o Construccionista.
2. Modelo Conductual.
3. Modelo Clínico-dinámico, perspectiva Médico-psiquiátrica.
4. Modelo Correlacional.
5. Modelo Clínico-dinámico, perspectiva Psicoanalítica.

Respuesta correcta: 1. Modelo Constructivista o Construccionista.